Clinical trial exclusion criterion:
presence of significant scarring in the pelvic area from previous surgery.

Entity relations:
- multi("from previous surgery", "surgery")
- Has_qualifier("significant scarring", "pelvic area")
- Has_qualifier("significant scarring", "from previous surgery")
- Has_temporal("surgery", "previous")